Clinical trial exclusion criteria:
Known allergy or hypersensitivity reaction to dexmedetomidine
Organ dysfunction (renal/hepatic failure or leukemia)
Cardiac disease (congenital or acquired)
Airway or thoracic malformation
Cerebral palsy
Hypotonia
Need for premedication
Current/recent upper respiratory infection (within four weeks prior to the surgery)
Asthma
Allergy or intolerance to clonidine
Non-English speaking parents/patients.

Annotated entities:
- Condition: "allergy"
- Condition: "hypersensitivity"
- Drug: "dexmedetomidine"
- Condition: "Organ dysfunction"
- Condition: "hepatic failure"
- Condition: "leukemia"
- Condition: "renal failure"
- Condition: "Cardiac disease"
- Qualifier: "congenital"
- Qualifier: "acquired"
- Condition: "thoracic malformation"
- Condition: "Airway malformation"
- Condition: "Cerebral palsy"
- Condition: "Hypotonia"
- Drug: "premedication"
- Mood: "Need for"
- Temporal: "Current"
- Temporal: "recent"
- Condition: "upper respiratory infection"
- Temporal: "within four weeks prior to the surgery"
- Reference_point: "the surgery"
- Procedure: "surgery"
- Condition: "Asthma"
- Condition: "Allergy"
- Condition: "intolerance"
- Drug: "clonidine"
- Observation: "Non-English speaking parents"
- Observation: "Non-English speaking patients"